Clinical trial exclusion criterion:
History of seizures

Annotated entities:
- Condition: "seizures"
- Temporal: "History"